Clinical trial exclusion criterion:
Epidural or subdural hematoma

Entity relations:
- OR("Epidural hematoma", "subdural hematoma")